Clinical trial exclusion criterion:
Toxic epidermal necrolysis with SCORTEN 6 or 7 at admission

Annotated entities:
- Condition: "Toxic epidermal necrolysis"
- Measurement: "SCORTEN"
- Value: "6 or 7"
- Temporal: "at admission"
- Reference_point: "admission"